Clinical trial exclusion criterion:
Prior stroke with functional impairment or other severe, uncontrolled medical problems that may impair ability to participate in the study exams, based on medical history and review of medical records

Entity relations:
- AND("stroke", "functional impairment")